Clinical trial exclusion criterion:
Diabetes Type I and II

Entity relations:
- OR("Diabetes Type I", "Diabetes Type II")